Clinical trial exclusion criterion:
Interest in future fertility

Annotated entities:
- Post-eligibility: "Interest in future fertility"
- Non-query-able: "Interest in future fertility"